Uno de los fármacos que se administran en el tratamiento de las convulsiones es:
1. Clorpramida.
2. Simvastatina.
3. Carbamacepina.
4. Propanolol.
5. Escitalopram.

Respuesta correcta: 3. Carbamacepina.